Clinical trial inclusion criterion:
Response assessment of complete response (CR), partial response (PR), long stable disease (SD) for >3 months with a cancer immunotherapy treatment for metastatic cancer or hematologic malignancies either through a marketed CPI or through participation in a Roche/Genentech CPI clinical trial.

Annotated entities:
- Measurement: "Response assessment"
- Value: "complete response (CR)"
- Value: "partial response (PR)"
- Value: "long stable disease (SD)"
- Temporal: "for >3 months"
- Qualifier: "cancer"
- Procedure: "immunotherapy treatment"
- Condition: "metastatic cancer"
- Condition: "hematologic malignancies"
- Procedure: "marketed CPI"
- Observation: "participation in a Roche/Genentech CPI clinical trial"